Clinical trial inclusion criterion:
Capable of providing written informed consent

Annotated entities:
- Observation: "written informed consent"
- Observation: "Capable of providing written informed consent"